Clinical trial inclusion criterion:
4. Patients with previous radiotherapy as definitive therapy for locally advanced non-small cell lung cancer are eligible, as long as the recurrence is outside the original radiation therapy port. Radiation therapy must have been completed >4 weeks prior to the initiation of study treatment. Patients who have received chemo/radiation for locally advanced NSCLC are not eligible. Patients who have received palliative radiation therapy for symptomatic metastases must have completed treatment >14 days prior the initiation of the study treatment.

Annotated entities:
- Procedure: "radiotherapy"
- Temporal: "previous"
- Qualifier: "locally advanced"
- Condition: "non-small cell lung cancer"
- Non-representable: "the recurrence is outside the original radiation therapy port"
- Procedure: "Radiation therapy"
- Temporal: ">4 weeks prior to the initiation of study treatment"
- Reference_point: "the initiation of study treatment"
- Qualifier: "locally advanced"
- Condition: "NSCLC"
- Procedure: "chemo"
- Procedure: "radiation"
- Negation: "not"
- Procedure: "palliative radiation therapy"
- Condition: "symptomatic metastases"
- Qualifier: "symptomatic"
- Temporal: ">14 days prior the initiation of the study treatment"
- Reference_point: "the initiation of the study treatment"